La aflatoxina B1 es un producto natural que debe su toxicidad a un producto de su metabolismo, muy reactivo, de naturaleza de :
1. 1,2-Diol.
2. Quinonimina.
3. Epóxido.
4. Carbonilo α,β-insaturado.
5. Radical hidroperóxido.

Respuesta correcta: 3. Epóxido.